Clinical trial inclusion criterion:
Subacute and chronic atopic subjects who have atopic dermatitis symptoms continually at least 6 months

Entity relations:
- Has_temporal("dermatitis symptoms", "continually at least 6 months")
- v-AND("dermatitis symptoms", "and")
- Has_qualifier("dermatitis symptoms", "Subacute")
- OR("Subacute", "chronic")